Clinical trial exclusion criteria:
pregnancy
past esophageal, gastric or bariatric surgery
irritable bowel, unexplained intermittent vomiting, severe abdominal pain, chronic diarrhea or constipation
history of gastric or duodenal ulcers
pre-operatory hypoalbuminemy
history of renal, hepatic, cardiac or pulmonary severe disease
taken of corticosteroid in the last month
evidence of psycological problem that may affect the capacity to understand the project and to comply with the medical recommandations
history of drug use or alcool abuse in the last 12 months
history of gastro-intestinal inflammatory diseases

Annotated entities:
- Condition: "pregnancy"
- Procedure: "bariatric surgery"
- Procedure: "gastric surgery"
- Procedure: "esophageal surgery"
- Condition: "irritable bowel"
- Condition: "vomiting"
- Condition: "abdominal pain"
- Qualifier: "intermittent"
- Condition: "diarrhea"
- Condition: "constipation"
- Qualifier: "chronic"
- Qualifier: "severe"
- Condition: "duodenal ulcers"
- Condition: "gastric ulcers"
- Condition: "hypoalbuminemy"
- Qualifier: "pre-operatory"
- Condition: "pulmonary disease"
- Condition: "cardiac disease"
- Condition: "hepatic disease"
- Condition: "renal disease"
- Qualifier: "severe"
- Drug: "corticosteroid"
- Temporal: "last month"
- Non-query-able: "evidence of psycological problem that may affect the capacity to understand the project and to comply with the medical recommandations"
- Condition: "alcool abuse"
- Condition: "drug use"
- Temporal: "last 12 months"
- Condition: "gastro-intestinal inflammatory diseases"